Advanced hormone-dependent prostate cancer for which androgen deprivation therapy is indicated, and independently from this trial, Firmagon® is intended to be used for treatment

The above is a clinical trial inclusion criterion. Annotated with entity spans:
[Qualifier: Advanced] [Qualifier: hormone-dependent] [Condition: prostate cancer] for which [Procedure: androgen deprivation therapy] is indicated, and independently from this trial, [Drug: Firmagon]® is [Mood: intended] to be used for treatment